惡性黑色棘皮症（malignant acanthosis nigricans）最常合併那種系統的腫瘤？
A. 呼吸系統
B. 腸胃系統
C. 生殖系統
D. 泌尿系統

正確答案：B. 腸胃系統